Clinical trial exclusion criterion:
history of bleeding peptic ulcer

Entity relations:
- AND("bleeding", "peptic ulcer")